Clinical trial exclusion criterion:
Use of any investigational or non-registered drug or vaccine product within 30 days preceding the administration of the study vaccine or planned use within the first six weeks of the study period

Annotated entities:
- Drug: "drug"
- Drug: "vaccine product"
- Qualifier: "investigational"
- Qualifier: "non-registered"
- Temporal: "within 30 days preceding the administration of the study vaccine"
- Reference_point: "the administration of the study vaccine"
- Non-query-able: "planned use"
- Temporal: "within the first six weeks of the study period"
- Mood: "planned use"
- Reference_point: "the study period"
- Context_Error: "Use of any investigational or non-registered drug or vaccine product within 30 days preceding the administration of the study vaccine or planned use within the first six weeks of the study period"